¿Cuál de los siguientes microorganismos es más sensible a la sequedad?
1. Neisseria meningitidis.
2. Bordetella pertussis.
3. Yersinia pestis.
4. Neisseria gonorrhoeae.

Respuesta correcta: 4. Neisseria gonorrhoeae.